Clinical trial exclusion criterion:
Subjects who have received any HDAC inhibitors other than valproic acid

Entity relations:
- Has_negation("valproic acid", "other than")
- AND("HDAC inhibitors", "valproic acid")